Una de las variables importantes en las técnicas de emisión es la temperatura, porque:
1. La energía emitida por los átomos varía exponencialmente con ella.
2. La población de átomos en estado excitado disminuye cuando aumenta.
3. La población de átomos en estado excitado aumenta cuando disminuye.
4. Al aumentar se evaporan los átomos y disminuye la señal analítica.
5. Al aumentar incrementa la potencia de la radiación electromagnética procedente de la lámpara de cátodo hueco.

Respuesta correcta: 1. La energía emitida por los átomos varía exponencialmente con ella.